一位 45 歲女性，平時健康，因間歇性發燒約 4 個月到門診求診，理學檢查有輕微結膜貧血徵象，下列那項檢查對診斷最沒有幫助？
A. 血液培養
B. Complete blood count
C. 心臟超音波檢查
D. 腦部電腦斷層攝影

正確答案：D. 腦部電腦斷層攝影